Clinical trial exclusion criterion:
Decompensated liver cirrhosis (CTP score = 7).

Entity relations:
- Has_value("CTP score", "= 7")
- AND("Decompensated liver cirrhosis", "CTP score")